Positive ANA OR anti-dsDNA within one year of screening

The above is a clinical trial inclusion criterion. Annotated with entity spans:
[Value: Positive] [Measurement: ANA] OR [Measurement: anti-dsDNA] [Temporal: within one year of screening]